Which is the role of the IFIT1 gene in Systemic Lupus Erythematosus (SLE)?

The IFIT1 gene, encoding the syntaxin binding protein 1, is highly expressed in Systemic Lupus Erythematosis (SLE) and its expression is downregulated significantly in cases of SLE. Loss of IFit1 expression is correlated with SLE disease activity and leads to activation of transcriptional mediator Gli2, with consequent inhibition of IκB kinase activity, resulting in dysfunction of myeloid cell growth and transformation to a malignant state.IFIT1 (interferon regulatory factor 1) is an interferon-binding protein that